Any history of cervical, penile, oral or anal cancers

The above is a clinical trial exclusion criterion. Annotated with entity spans:
[Temporal: Any history] of cervical, [Condition: penile], [Condition: oral] or [Condition: anal cancers]